Clinical trial exclusion criterion:
History of intolerance (including Grade 3-4 infusion reaction) or hypersensitivity to trastuzumab, murine proteins, or docetaxel.

Entity relations:
- Has_value("Grade", "3-4")
- AND("infusion reaction", "Grade")
- AND("hypersensitivity", "trastuzumab")
- Subsumes("intolerance", "infusion reaction")
- Has_temporal("intolerance", "History of")
- OR("trastuzumab", "docetaxel", "murine proteins")
- OR("intolerance", "hypersensitivity")